El material genético de los filovirus es:
1. DNA bicatenario.
2. RNA bicatenario (+).
3. RNA monocatenario (-).
4. RNA monocatenario (+).

Respuesta correcta: 3. RNA monocatenario (-).